What do the trispecific HIV antibodies target?

Trispecific HIV antibodies (Abs) allow a single molecule to interact with three independent HIV-1 envelope determinants: the CD4 binding site, the membrane-proximal external region (MPER), and the V1V2 glycan site.